下列那一項物質存在革蘭氏陰性細菌中，而不存在革蘭氏陽性細菌中？
A. 胜	肽	聚 糖 （peptidoglycan）
B. 脂質 A（lipid A）
C. 莢膜（capsule）
D. 鞭毛（flagella）

正確答案：B. 脂質 A（lipid A）